Clinical trial exclusion criterion:
History of Stevens-Johnson Syndrome and Erythema multiforme.

Entity relations:
- OR("Stevens-Johnson Syndrome", "Erythema multiforme")